Clinical trial exclusion criterion:
BMI > 30

Entity relations:
- Has_value("BMI", "> 30")